下列何者為影響外陰癌最重要之預後因子？
A. 腫瘤大小
B. 細胞組織型態
C. 淋巴結轉移
D. 泌尿系統侵犯

正確答案：C. 淋巴結轉移